Clinical trial exclusion criterion:
Subjects who will be inaccessible due to geographic or social factors during treatment or follow-up

Entity relations:
- Has_temporal("inaccessible", "during treatment or follow-up")
- Has_index("during treatment or follow-up", "treatment")
- Has_index("during treatment or follow-up", "follow-up")